> 18 years of age and < 70 years of age

The above is a clinical trial inclusion criterion. Annotated with entity spans:
[Value: > 18 years] of age and < 70 years of [Person: age]